Clinical trial exclusion criterion:
Woman of child-bearing potential not taking adequate contraception deemed reliable by the investigator.

Annotated entities:
- Person: "Woman"
- Condition: "child-bearing potential"
- Procedure: "contraception"
- Qualifier: "adequate"
- Subjective_judgement: "adequate"
- Subjective_judgement: "deemed reliable by the investigator"
- Negation: "not"
- Qualifier: "deemed reliable by the investigator"
- Pregnancy_considerations: "Woman of child-bearing potential not taking adequate contraception deemed reliable by the investigator."